previous spine fusion surgery

The above is a clinical trial exclusion criterion. Annotated with entity spans:
[Temporal: previous] [Procedure: spine fusion surgery]